Clinical trial inclusion criterion:
FEV1/SVC <70% of predicted value post bronchodilator (SVC is slow VC) and FEV1 < 80% of predicted value post-bronchodilator

Annotated entities:
- Measurement: "FEV1/SVC"
- Value: "<70% of predicted value"
- Qualifier: "post bronchodilator"
- Temporal: "post bronchodilator"
- Drug: "bronchodilator"
- Measurement: "FEV1"
- Value: "< 80% of predicted value"
- Qualifier: "post-bronchodilator"
- Temporal: "post-bronchodilator"
- Drug: "bronchodilator"
- Reference_point: "bronchodilator"
- Reference_point: "bronchodilator"